過度使用外用類固醇製劑於皮膚時常見之副作用中，並未包括下列何者？
A. 多毛症（hypertrichosis）
B. 色素沉著（hyperpigmentation）
C. 傷口不易癒合
D. 皮膚萎縮紋（atrophic striae）

正確答案：B. 色素沉著（hyperpigmentation）